一位懷孕 28 週的 23 歲女性，因為最近一週陰道分泌物增加、有異味且會癢而來求診。陰道抹片發現有 clue cells，她沒有糖尿病或其他內科疾病，此時該如何治療這位病人？
A. oral clindamycin
B. vaginal premarin cream
C. oral fluconazole
D. vaginal metronidazole

正確答案：D. vaginal metronidazole